有關愛滋防治政策的倫理性，下列敘述何者錯誤？
A. 為了避免愛滋感染者被歧視，相關通報應該保障當事人隱私
B. 國家免費提供愛滋感染者相關醫療，有助於降低強制篩檢在倫理上的爭議
C. 縱使民眾可能因為陽性的篩檢結果而受到許多心理與社會衝擊，但為了國民健康，國家還是應該強制所有民眾接受愛滋篩檢
D. 醫師不能只因為病人有愛滋病，就拒絕治療病人

正確答案：C. 縱使民眾可能因為陽性的篩檢結果而受到許多心理與社會衝擊，但為了國民健康，國家還是應該強制所有民眾接受愛滋篩檢